Subjects who take atypical antipsychotic drugs, and should be maintained on current antipsychotic drugs (including atypical antipsychotic drugs) and dose for at least 4 weeks prior to the screening.

The above is a clinical trial inclusion criterion. Annotated with entity spans:
Subjects who take [Drug: atypical antipsychotic drugs], [Non-representable: and should be maintained on current antipsychotic drugs (including atypical antipsychotic drugs) and dose for at least 4 weeks prior to the screening].